Clinical trial exclusion criterion:
antiemetic neuroleptics

Annotated entities:
- Drug: "antiemetic neuroleptics"